Clinical trial exclusion criterion:
Contraindication of CT Known allergy to iodinated contrast media or history of contrast-induced nephropathy Decreased renal function: elevated serum creatinine(>1.5mg/dl) Contraindication to beta-blockers Severe arrhythmia: arterial fibrillation or uncontrolled tachyarrhythmia, or advanced atrioventricular block (second or third degree heart block)

Annotated entities:
- Condition: "Contraindication of CT"
- Condition: "Known allergy"
- Drug: "iodinated contrast media"
- Condition: "contrast-induced nephropathy"
- Measurement: "renal function"
- Value: "Decreased"
- Value: "elevated"
- Measurement: "serum creatinine"
- Value: ">1.5mg/dl"
- Drug: "beta-blockers"
- Condition: "Contraindication"
- Condition: "arrhythmia"
- Qualifier: "Severe"
- Condition: "arterial fibrillation"
- Condition: "uncontrolled tachyarrhythmia"
- Condition: "advanced atrioventricular block"
- Condition: "third degree heart block"
- Condition: "second degree heart block"
- Line: "Contraindication of CT"
- Line: "Known allergy to iodinated contrast media or history of contrast-induced nephropathy"
- Line: "Decreased renal function: elevated serum creatinine(>1.5mg/dl)"
- Line: "Contraindication to beta-blockers"
- Line: "Severe arrhythmia: arterial fibrillation or uncontrolled tachyarrhythmia, or advanced atrioventricular block (second or third degree heart block)"